¿Cuál de los nucleófilos relacionados a continuación, presenta una mayor reactividad frente a la reacción de sustitución nucleofílica bimolecular?
1. Hidróxido.
2. Yoduro.
3. Amoniaco.
4. Agua.
5. Ácido acético.

Respuesta correcta: 2. Yoduro.